Clinical trial exclusion criterion:
Stroke or Transient Ischemic Attack (TIA) within the past 6 months or any permanent residual neurological defect

Entity relations:
- Has_temporal("Stroke", "within the past 6 months")
- OR("Stroke", "Transient Ischemic Attack (TIA)")
- OR("Stroke", "residual neurological defect")